Concurrent antibiotherapy

The above is a clinical trial exclusion criterion. Annotated with entity spans:
[Temporal: Concurrent] [Drug: antibiotherapy]